有關急性壓力疾患（acute stress disorder）及創傷後壓力症候群（posttraumatic stress disorder）之敘述，下列何者錯誤？
A. 急性壓力疾患之症狀若超過一個月以上則需考慮診斷可能為創傷後壓力症候群
B. 創傷後壓力症候群治療合併藥物治療及心理治療是有助益的
C. 急性壓力疾患之症狀中不會出現解離症狀
D. 創傷後壓力症候群的病因包含hypothalamic-pituitary-adrenal（HPA）axis之功能失調

正確答案：C. 急性壓力疾患之症狀中不會出現解離症狀